Clinical trial exclusion criterion:
Contraindication to anticoagulation (i.e., heparin, warfarin or another commercially available anticoagulation medication)

Entity relations:
- AND("Contraindication", "anticoagulation")
- Subsumes("anticoagulation", "heparin")
- OR("heparin", "warfarin")